La regulación enzimática por modificación covalente reversible:
1. Implica la ruptura del enlace peptídico.
2. Requiere la acción de otra enzima.
3. Siempre implica reacción de fosforilación.
4. Nunca afecta a enzimas alostéricos.
5. La enzima nunca se presenta en dos formas.

Respuesta correcta: 2. Requiere la acción de otra enzima.